Patients on life support or in a critical care unit.

The above is a clinical trial exclusion criterion. Annotated with entity spans:
Patients on [Procedure: life support] or in a [Visit: critical care unit].